Presence of clinically significant (grade 2-4) anterior segment abnormalities

The above is a clinical trial exclusion criterion. Annotated with entity spans:
Presence of [Qualifier: clinically significant] ([Qualifier: grade 2-4]) [Condition: anterior segment abnormalities]